Clinical trial exclusion criterion:
In clinical judgement of study doctor, participant should not participate.

Annotated entities:
- Non-query-able: "In clinical judgement of study doctor, participant should not participate"